下	列	何 種	細	胞	的	分	泌	顆粒	含 溶	菌酶（lysozyme）？
A. 潘氏細胞（Paneth cells）
B. 杯狀細胞（goblet cells）
C. 腸內分泌細胞（enteroendocrine cells）
D. 黏液分泌細胞（mucus-secreting cells）

正確答案：A. 潘氏細胞（Paneth cells）